Clinical trial inclusion criterion:
1. Age: 18-75 years old, no limitation in gender;

Entity relations:
- Has_value("Age", "18-75 years")